Clinical trial inclusion criterion:
Have ≥2 days/week of heavy drinking (>4 drinks/day)

Annotated entities:
- Multiplier: "≥2 days/week"
- Condition: "heavy drinking"
- Value: ">4"
- Measurement: "drinks/day"